Clinical trial exclusion criterion:
Coagulopathies (with prothrombin concentration less than 60% or INR more than 1.5)

Annotated entities:
- Condition: "Coagulopathies"
- Measurement: "prothrombin concentration"
- Value: "less than 60%"
- Value: "more than 1.5"
- Measurement: "INR"